Clinical trial exclusion criterion:
Teeth with clinical symptoms of irriversible pulpitis or pulp necrosis or acute dental infection

Entity relations:
- Has_qualifier("irriversible pulpitis", "Teeth")
- Has_qualifier("pulp necrosis", "Teeth")
- OR("irriversible pulpitis", "acute dental infection", "pulp necrosis")